影響吸入性麻醉氣體麻醉深度的決定因素為何？
A. 呼吸速率
B. 麻醉藥物之效能（potency）
C. 麻醉藥物腦中濃度
D. 心輸出量（cardiac output）

正確答案：C. 麻醉藥物腦中濃度